Clinical trial exclusion criterion:
Anemia (hemoglobin < 9 mg/dl) or thrombocytopenia (Platelet count <75), or thrombocytosis (Platelet count >600)

Annotated entities:
- Condition: "Anemia"
- Measurement: "hemoglobin"
- Value: "< 9 mg/dl"
- Condition: "thrombocytopenia"
- Measurement: "Platelet count"
- Value: "<75"
- Condition: "thrombocytosis"
- Measurement: "Platelet count"
- Value: ">600"